下列何者可能會導致低血壓、急性腸胃炎，甚至休克及代謝性酸中毒（metabolic acidosis）等中毒症狀？
A. 急性無機砷中毒（acute inorganic arsenic poisoning）
B. 急性無機汞中毒（acute inorganic mercury intoxication）
C. 鉈鹽中毒（thallium salts intoxication）
D. 放射性銫中毒（radioactive cesium（137Cs）intoxication）

正確答案：A. 急性無機砷中毒（acute inorganic arsenic poisoning）